Clinical trial inclusion criterion:
Any patient age 4-16 years with sickle cell disease who presents the Pediatric ER with acute sickle cell pain crisis with a pain of 6/10 or higher

Annotated entities:
- Person: "age"
- Value: "4-16 years"
- Condition: "sickle cell disease"
- Visit: "Pediatric ER"
- Condition: "acute sickle cell pain crisis"
- Measurement: "pain"
- Value: "6/10 or higher"